Treatment is not with the intent to cure the infection (that is, palliative care is an exclusion).

The above is a clinical trial exclusion criterion. Annotated with entity spans:
[Non-query-able: Treatment is not with the intent to cure the infection (that is, palliative care is an exclusion)].